Known allergy to Granisetron or local anaesthetic (heavy bupivacaine, Marcaine Spinal 0.5% Heavy, 5mg/ml, AstraZeneca ampule)

The above is a clinical trial exclusion criterion. Annotated with entity spans:
Known [Condition: allergy] to [Drug: Granisetron] or [Drug: local anaesthetic] ([Drug: heavy bupivacaine], [Drug: Marcaine Spinal 0.5% Heavy], [Qualifier: 5mg/ml], [Qualifier: AstraZeneca ampule])